下列何者與腸胃促進劑 Cisapride 併用易造成心律不整？
A. Ketoconazole
B. Amphotericin B
C. Griseofulvin
D. Nystatin

正確答案：A. Ketoconazole